Clinical trial exclusion criterion:
Pre-existent neutropenia (neutrophils <1,500/mm3) or thrombocytopenia (platelets < 90,000/mm3)

Annotated entities:
- Condition: "neutropenia"
- Qualifier: "Pre-existent"
- Measurement: "neutrophils"
- Value: "<1,500/mm3"
- Condition: "thrombocytopenia"
- Measurement: "platelets"
- Value: "< 90,000/mm3"